關於鼻竇炎（paranasal sinusitis）的影像診斷，下列何者錯誤？
A. 電腦斷層（CT scan）較X光清楚，但輻射劑量較高
B. 慢性鼻竇炎且抗生素治療數週無效者，應考慮做電腦斷層檢查
C. 急性鼻竇炎合併意識不清，以X光的Water's view就足以診斷病灶影響範圍 ，不必接受電腦斷層檢查
D. 注射對比劑後之電腦斷層影像有助於排除鼻竇炎合併有腫瘤的可能性

正確答案：C. 急性鼻竇炎合併意識不清，以X光的Water's view就足以診斷病灶影響範圍 ，不必接受電腦斷層檢查